Clinical trial inclusion criteria:
between 7 to 70 years of age
fluent in English or Spanish
plans to receive care in the Community Health Center during the next year
presents with signs and symptoms of a SSTI
willing/able to provide informed consent

Annotated entities:
- Value: "between 7 to 70 years"
- Person: "age"
- Observation: "fluent in English"
- Observation: "fluent in Spanish"
- Mood: "plans to"
- Procedure: "receive care"
- Visit: "Community Health Center"
- Temporal: "during the next year"
- Condition: "signs"
- Condition: "symptoms"
- Condition: "SSTI"
- Informed_consent: "willing/able to provide informed consent"